Clinical trial inclusion criterion:
Signs of (RV) failure as indicated by NT-proBNP levels >600 pg/ml at baseline.

Entity relations:
- Has_value("NT-proBNP levels", ">600 pg/ml")
- AND("RV) failure", "NT-proBNP levels")